一般而言，顱縫早閉（craniosynostosis）的病童，何時進行手術治療較適當？
A. 三個月內
B. 三到六個月內
C. 六到十八個月
D. 兩歲以上

正確答案：C. 六到十八個月